Alpha fetoprotein > 50 ng/ml

The above is a clinical trial exclusion criterion. Annotated with entity spans:
[Measurement: Alpha fetoprotein] [Value: > 50 ng/ml]